Which is the target of belimumab in Systemic Lupus Erythematosus treatment?

Belimumab is a fully human monoclonal antibody directed against BAFF.  Belimumab, a human monoclonal antibody specific for soluble BLyS, was ultimately approved by the United States Food and Drug Administration (FDA) in March 2011 for active autoantibody patients with systemic lupus erythematosus (SLE) despite standard therapy.